Ante un paciente con sospecha de penfigoide ampolloso, ¿cuál de las siguientes pruebas deberíamos realizar para confirmar el diagnóstico?
1. Dermatoscopia.
2. Cultivo del contenido de una ampolla.
3. Biopsia de la piel para cultivo.
4. Biopsia de la piel para estudio histológico e inmunofluorescencia directa.
5. Analítica con determinación de anticuerpos antinucleares y anti DNA.

Respuesta correcta: 4. Biopsia de la piel para estudio histológico e inmunofluorescencia directa.